Clinical trial exclusion criterion:
Drug-induced hypotension, if necessary, evaluate patient after discontinuing the causative drug for one month

Entity relations:
- Has_qualifier("hypotension", "Drug-induced")